Clinical trial exclusion criterion:
Coagulation disorders;

Annotated entities:
- Condition: "Coagulation disorders"